Clinical trial exclusion criterion:
General danger signs or symptoms of severe malaria

Entity relations:
- Has_qualifier("malaria", "severe")